王太太今年 62 歲，因呼吸困難被送至急診室，經過插管輔以人工呼吸器幫助後，生命徵象穩定、意識清醒、血氧濃度正常。大約 2 個月前王太太開始飲食不正常，常常飯吃到一半就吞不下去，所以體重逐漸減輕。早上還可以自己走路去買菜，但一到下午就眼皮張不開，無精打采，外出散步時沒走幾分鐘就走不動。王太太最有可能罹患下列那一個疾病？
A. 心臟衰竭（heart failure）
B. 重症肌無力（myasthenia gravis）
C. 慢性阻塞性肺病（chronic obstructive pulmonary disease）
D. 急性發炎性脫髓鞘型多發神經病變（acute inflammatory demyelinating polyneuropathy）

正確答案：B. 重症肌無力（myasthenia gravis）